Pregnant women.

The above is a clinical trial exclusion criterion. Annotated with entity spans:
[Condition: Pregnant] [Person: women].